¿Cuál de los siguientes medicamentos puede producir insuficiencia renal en pacientes que presentan estenosis bilateral de la arteria renal por inhibir el tono constrictor de la arteriola eferente?:
1. Acetaminofeno.
2. Diclofenaco.
3. Enalaprilo.
4. Metamizol.
5. Furosemida.

Respuesta correcta: 3. Enalaprilo.